Clinical trial exclusion criterion:
Life expectancy less than 12 months

Entity relations:
- Has_value("Life expectancy", "less than 12 months")